Clinical trial inclusion criterion:
1. Newly diagnosed, stage IV squamous cell lung cancer. This includes patients who present with disseminated metastases, and those with a malignant pleural or pericardial effusion (i.e., formerly stage IIIB in the 6th TNM staging system).

Entity relations:
- multi("Newly diagnosed", "Newly")
- Has_value("stage", "IV")
- multi("stage IV", "stage")
- Has_qualifier("squamous cell lung cancer", "stage IV")
- Has_qualifier("metastases", "disseminated")
- Has_qualifier("pleural effusion", "malignant")
- Has_value("6th TNM staging system", "stage IIIB")
- Subsumes("malignant", "6th TNM staging system")
- OR("pleural effusion", "pericardial effusion")